Women with Non-proteinuric hypertension

The above is a clinical trial exclusion criterion. Annotated with entity spans:
[Person: Women] with [Condition: Non-proteinuric hypertension]